下列何者是醫學過度專科化最可能產生之現象？
A. 專科醫師的培訓過程自然而然會考量病人的所有問題
B. 病人與專科醫師間的溝通會更順暢無礙
C. 大型教學醫院的專科醫師常須從事一般性門診服務
D. 診所的開業醫師必須提供尖端醫療科技服務

正確答案：C. 大型教學醫院的專科醫師常須從事一般性門診服務